有關卵巢濾泡中分泌 sex hormones 的細胞，下列敘述何者正確？
A. 只限於顆粒細胞（granulosa cells）
B. 顆粒細胞及基礎細胞（basal cells）
C. 卵囊膜細胞（theca cells）及基礎細胞
D. 顆粒細胞及卵囊膜細胞

正確答案：D. 顆粒細胞及卵囊膜細胞